Clinical trial inclusion criterion:
with mechanical ventilation initiated in the first 48 hours following hospital admission

Annotated entities:
- Procedure: "mechanical ventilation"
- Temporal: "first 48 hours following hospital admission"
- Reference_point: "hospital admission"